Clinical trial exclusion criterion:
Receipt of blood or blood products 8 weeks prior to vaccination or planned administration during the three week study period following vaccination

Annotated entities:
- Procedure: "Receipt of blood"
- Procedure: "Receipt of blood products"
- Temporal: "8 weeks prior to vaccination"
- Reference_point: "vaccination"
- Temporal: "during the three week study period following vaccination"
- Reference_point: "three week study period following vaccination"
- Mood: "planned administration"